Clinical trial exclusion criterion:
Severe intercurrent infection

Entity relations:
- Has_qualifier("infection", "Severe")
- Has_temporal("infection", "intercurrent")